Clinical trial inclusion criterion:
Minimum posterior disc height of 5mm at the index level(s).

Entity relations:
- Has_qualifier("posterior disc height", "index level(s)")
- Has_value("posterior disc height", "Minimum of 5mm")